Clinical trial inclusion criteria:
women previously diagnosed with generalized vulvodynia
women previously diagnosed with localized vestibulodynia,

Annotated entities:
- Condition: "generalized vulvodynia"
- Person: "women"
- Condition: "localized vestibulodynia"
- Person: "women"